El crisol de Gooch es:
1. Una superficie gelatinosa para precipitar coloides.
2. Un vaso de cerámica para mineralizar muestras en horno mufla.
3. Un medio de filtración para análisis gravimétricos.
4. Una superficie fabricada con pulpa de papel de uso general.

Respuesta correcta: 3. Un medio de filtración para análisis gravimétricos.